Those who age between 30 and 80 years old and can inject insulin by themselves.

The above is a clinical trial inclusion criterion. Annotated with entity spans:
Those who [Person: age] [Value: between 30 and 80 years old] and [Observation: can] [Procedure: inject insulin] by themselves.